Which is the primary interacting protein of BLK?

BLK interacts with at least two of the three kinases in the B-cell/proteasome pathway, namely the transcription factor BANK1 and the chromatin-associated transcription factor 1 (CACGT1).